50 歲女性病患主訴近半年來常頭痛，有時會於半夜痛醒。神經學檢查發現病患神智清醒，言語正常，嗅覺明顯變差，四肢活動正常，步態也正常。病人配偶描述病患個性變得比較懶散，不積極，對家人也較不關心。則最可能的診斷為？
A. 水腦症
B. 前顱窩腦瘤
C. 腦中風
D. 聽 神經瘤

正確答案：B. 前顱窩腦瘤